Adult (=18 years)

The above is a clinical trial inclusion criterion. Annotated with entity spans:
[Person: Adult] ([Value: =18 years])